El Código Deontológico de la Enfermería Española:
1. Constituye las normas mínimas de actuación para la Enfermería.
2. Es una Ética deontológica de máximos para la Enfermería.
3. Es un puente entre la responsabilidad patrimonial y la colegial.
4. Es un conjunto de pautas orientativas para el ejercicio profesional.
5. Se dirige a las pautas para la correcta asistencia a los enfermos.

Respuesta correcta: 1. Constituye las normas mínimas de actuación para la Enfermería.